當上頸部發現有三公分以上之硬塊時，下列處置何者優先考慮？
A. 針吸檢查
B. 頸部切片檢查
C. 開刀切除
D. 檢查鼻咽腔、鼻腔、口腔與喉部

正確答案：D. 檢查鼻咽腔、鼻腔、口腔與喉部